一位 12 歲女童因脾氣暴躁、容易失眠、體重減輕而就診，身體檢查發現其心跳每分鐘 140 下，兩眼突出，雙手有顫抖現象。下列那一項檢查結果與此病人的臨床表徵最不相符？
A. 血清 T3 值 350 ng/dL
B. 血清 free T4 值 3.0 ng/dL
C. 血清 T4 值 18.0 μg/dL
D. 血清 TSH 值 5.0 μIU/mL

正確答案：D. 血清 TSH 值 5.0 μIU/mL